PCI/MI within the past 2 months (60 days)

The above is a clinical trial exclusion criterion. Annotated with entity spans:
[Procedure: PCI]/[Condition: MI] [Temporal: within the past 2 months] (60 days)